下列那一種蛋白質具有抑制細胞凋亡（apoptosis）之功能？
A. Bak
B. Bax
C. Bcl-2
D. FASL

正確答案：C. Bcl-2